current infectious disease, and

The above is a clinical trial exclusion criterion. Annotated with entity spans:
[Temporal: current] [Condition: infectious disease], and